Clinical trial inclusion criterion:
Cared for in the pediatric intensive care unit or pediatric cardiac intensive care unit

Annotated entities:
- Visit: "pediatric intensive care unit"
- Visit: "pediatric cardiac intensive care unit"